有關惡性骨腫瘤的敘述，下列何者最正確？
A. Enneking stage IIB是指高惡性度，同一腔室內的病灶（intra-compartmental lesion）
B. 目前惡性骨肉瘤（osteosarcoma）的標準治療，是先切除腫瘤，再輔以術後放射治療，以避免局部復發
C. 惡性軟骨瘤（chondrosarcoma）的治療主要是手術切除病灶
D. 肢體保留手術與截肢手術相比，局部腫瘤復發率較高，同時接受肢體保留手術患者存活率較低

正確答案：C. 惡性軟骨瘤（chondrosarcoma）的治療主要是手術切除病灶